Clinical trial exclusion criterion:
Malabsorptive GI disease, such as celiac disease, or gastric bypass

Annotated entities:
- Condition: "Malabsorptive GI disease"
- Condition: "celiac disease"
- Procedure: "gastric bypass"